Clinical trial exclusion criterion:
Metabolic or hormonal abnormalities.

Annotated entities:
- Condition: "hormonal abnormalities"
- Condition: "Metabolic abnormalities"